Clinical trial exclusion criterion:
3. Subject underwent metal graft treatment;

Entity relations:
- AND("metal graft treatment", "metal graft")